Signed informed consent to participate in the study.

The above is a clinical trial inclusion criterion. Annotated with entity spans:
[Post-eligibility: Signed informed consent to participate in the study.]